一位病人罹患肺結核，醫師給予抗結核藥物，通常會給予何種維生素以防止 isoniazid 造成的副作用？
A. Thiamine
B. 維生素B6B
C. 葉酸（Folate）
D. 維生素B12B

正確答案：B. 維生素B6B